Bilirubin less than 1.5x upper limit of normal, AST less than 3x upper limit of normal, serum creatinine less than 1.5x normal and Hgb 8.0 g/dL or greater

The above is a clinical trial inclusion criterion. Annotated with entity spans:
[Measurement: Bilirubin] [Value: less than 1.5x upper limit of normal], [Measurement: AST] [Value: less than 3x upper limit of normal], serum creatinine less than 1.5x normal and Hgb 8.0 g/dL or greater